掌握非法藥物之流行趨勢以及相關危險因子是重要的公共衛生任務，下列何者錯誤？
A. 目前藥物濫用之調查方式可包括主動調查（以橫斷性調查為主）以及被動調查（通報系統）
B. 許多研究均顯示自我陳報（self-report）常有低報的現象
C. 實驗室藥檢最能藉以評估受試者之非法藥物使用，其效度不受檢驗方法、檢體種類或其時效性影響
D. 「電腦輔助式自我訪談」可以提高藥物使用的自我陳報率

正確答案：C. 實驗室藥檢最能藉以評估受試者之非法藥物使用，其效度不受檢驗方法、檢體種類或其時效性影響